Clinical trial inclusion criterion:
American Society of Anesthesiology (ASA) I-III;

Entity relations:
- Has_value("American Society of Anesthesiology (ASA)", "I-III")